SGLT2 inhibitor, TZD, DPP4 inhibitor and GLP1 RA use within the past 6 months

The above is a clinical trial exclusion criterion. Annotated with entity spans:
[Drug: SGLT2 inhibitor], [Drug: TZD], [Drug: DPP4 inhibitor] and [Drug: GLP1 RA] use [Temporal: within the past 6 months]